Clinical trial exclusion criterion:
HIV-positive subjects on combination antiretroviral therapy are ineligible because of the potential for pharmacokinetic interactions with Venetoclax. In addition, these subjects are at increased risk of lethal infections when treated with marrow suppressive therapy. Appropriate studies will be undertaken in subjects receiving combination antiretroviral therapy when indicated. HIV testing prior to enrollment is not required for screening but strongly encouraged for patients with no documented prior HIV assessment.

Annotated entities:
- Condition: "HIV-positive"
- Procedure: "combination antiretroviral therapy"
- Parsing_Error: "Appropriate studies will be undertaken in subjects receiving combination antiretroviral therapy when indicated."
- Not_a_criteria: "Appropriate studies will be undertaken in subjects receiving combination antiretroviral therapy when indicated."
- Not_a_criteria: "HIV testing prior to enrollment is not required for screening but strongly encouraged for patients with no documented prior HIV assessment."
- Non-representable: "In addition, these subjects are at increased risk of lethal infections when treated with marrow suppressive therapy."